Clinical trial inclusion criterion:
4. In the past one month, the clinical condition (including history, clinical symptoms and signs) was relatively stable;

Annotated entities:
- Temporal: "In the past one month"
- Temporal: "history"
- Condition: "clinical symptoms"
- Condition: "clinical signs"
- Qualifier: "relatively stable"